Las sustancias que evitan los cambios bruscos en el pH de una solución al añadir a la misma un ácido o una base se denominan:
1. Cuerpos acetoacéticos.
2. Tampones.
3. Hidrogeniones.
4. Anhidrasas.
5. Las respuestas 2 y 3 son las correctas.

Respuesta correcta: 2. Tampones.